Dentro de las técnicas de detección que pueden acoplarse a la electroforesis capilar está la detección amperométrica. En ella:
1. Se mide la corriente resultante de la oxidación o reducción de sustancias electroactivas en la superficie de un electrodo como consecuencia de la aplicación de un potencial.
2. Se mide una diferencia de potencial entre un electrodo selectivo de iones miniaturizado colocado al final del capilar y un electrodo de referencia convencional.
3. Se emplean dos electrodos enfrentados y en contacto con una disolución, de forma que al aplicar un campo eléctrico cruzado los iones se desplazan produciendo una corriente eléctrica que constituye la señal analítica.
4. Se utiliza un desacoplador en combinación con un alto voltaje de forma que el potencial generado aumenta hasta producir la total separación en el detector potenciostático.

Respuesta correcta: 1. Se mide la corriente resultante de la oxidación o reducción de sustancias electroactivas en la superficie de un electrodo como consecuencia de la aplicación de un potencial.